Clinical trial exclusion criteria:
Bismuth compounds, acid inhibitor, or antibiotics during 4 weeks before the patient is enrolled
Allergic to the medications
Upper gastrointestinal surgery history
Serious heart insufficiency, liver insufficiency, renal insufficiency and other serious medical problems
Evidence of blood dyscrasia
Pregnant and lactating women
Can't express his complain correctly and can't cooperate with the researcher

Annotated entities:
- Drug: "Bismuth compounds"
- Drug: "acid inhibitor"
- Drug: "antibiotics"
- Temporal: "during 4 weeks before the patient is enrolled"
- Reference_point: "the patient is enrolled"
- Condition: "Allergic"
- Drug: "medications"
- Procedure: "Upper gastrointestinal surgery"
- Temporal: "history"
- Qualifier: "Serious"
- Condition: "heart insufficiency"
- Condition: "liver insufficiency"
- Condition: "renal insufficiency"
- Qualifier: "other"
- Condition: "serious medical problems"
- Condition: "blood dyscrasia"
- Mood: "Evidence"
- Condition: "Pregnant"
- Condition: "lactating"
- Person: "women"
- Non-query-able: "Can't express his complain correctly and can't cooperate with the researcher"